El número de genotipos heterocigóticos distintos en la descendencia de un polihíbrido es:
1. 2n.
2. 4n.
3. 3n-2n.
4. 4n-3n.

Respuesta correcta: 3. 3n-2n.